Clinical trial inclusion criterion:
Evidence of puberty: physical signs and serum luteinizing hormone > 0.3 IU/L and testosterone > 15 ng/dl

Entity relations:
- Has_value("testosterone", "> 15 ng/dl")
- Has_value("serum luteinizing hormone", "> 0.3 IU/L")
- AND("Evidence of puberty", "serum luteinizing hormone")
- AND("Evidence of puberty", "physical signs")
- OR("serum luteinizing hormone", "testosterone")